Clinical trial exclusion criterion:
Body Mass Index >35

Entity relations:
- Has_value("Body Mass Index", ">35")